Clinical trial inclusion criterion:
If female, willing to use contraception throughout the study

Entity relations:
- AND("female", "contraception")
- Has_temporal("contraception", "throughout the study")